18 years of age and older,

The above is a clinical trial inclusion criterion. Annotated with entity spans:
[Value: 18 years] of [Person: age] and older,